Clinical trial inclusion criterion:
a high risk profile of the patient, defined as a CHA2DS2-VASc score = 3 and a HAS-BLED score = 2

Entity relations:
- Has_value("CHA2DS2-VASc score", "= 3")
- Has_value("HAS-BLED score", "= 2")
- Subsumes("high risk profile", "CHA2DS2-VASc score")
- Subsumes("high risk profile", "HAS-BLED score")